12. Other serious illnesses (e.g., serious infections requiring antibiotics, bleeding disorders).

The above is a clinical trial exclusion criterion. Annotated with entity spans:
[Parsing_Error: 12.] Other [Qualifier: serious] [Condition: illnesses] (e.g., [Qualifier: serious] [Condition: infections requiring antibiotics], [Condition: bleeding disorders]).